Clinical trial exclusion criterion:
Is a nursing or pregnant female, or intends to become pregnant within 6 months after receiving trial medication

Entity relations:
- Has_temporal("pregnant", "within 6 months after receiving trial medication")
- Has_mood("pregnant", "intends to become")
- OR("nursing", "pregnant")